Clinical trial exclusion criterion:
Invasive fungal infections in history and at present

Entity relations:
- Has_qualifier("fungal infections", "Invasive")